Clinical trial exclusion criterion:
Allergy to cis-UCA, or any constituents of the placebo emulsion cream or any constituents of Protopic® ointment

Entity relations:
- AND("Allergy", "cis-UCA")
- OR("cis-UCA", "Protopic® ointment", "placebo emulsion cream")